Clinical trial inclusion criterion:
Male and female subjects aged 20 years or older at informed consent

Entity relations:
- Has_value("aged", "20 years or older")
- Has_index("at informed consent", "informed consent")
- OR("Male", "female")